Clinical trial exclusion criterion:
Patients with poorly controlled major psychiatric pathology.

Entity relations:
- Has_qualifier("psychiatric pathology", "major")
- Has_qualifier("psychiatric pathology", "poorly controlled")